下列那一項不是早期卵巢癌的高危險預後因子？
A. 亮細胞（clear cell type）
B. 腫瘤長到表面
C. 腹水
D. 手術中腫瘤破裂

正確答案：D. 手術中腫瘤破裂